Explain the association between Barr bodies (nuclear inclusions) and the X chromosome?

Barr body is an inactivated X chromosome in the normal female somatic cell.